Clinical trial exclusion criterion:
Cannot stand general anesthesia

Annotated entities:
- Observation: "Cannot stand"
- Procedure: "general anesthesia"